patient's refusal

The above is a clinical trial exclusion criterion. Annotated with entity spans:
[Informed_consent: patient's refusal]